13. Treatment with systemic corticosteroids (>15 mg/day), or current immunosuppressive agents

The above is a clinical trial exclusion criterion. Annotated with entity spans:
[Parsing_Error: 13.] [Procedure: Treatment] with [Drug: systemic corticosteroids] ([Value: >15 mg/day]), or [Temporal: current] [Drug: immunosuppressive agents]